Clinical trial inclusion criterion:
Age 18 years-65 years old

Entity relations:
- Has_value("Age", "18 years-65 years old")